下列何者中毒時，在臨床上可用其抗體當作解毒劑？
A. cyanide
B. benzodiazepines
C. digoxin
D. isoniazid

正確答案：C. digoxin